Clinical trial exclusion criterion:
Biliary strictures caused by confirmed benign tumors

Annotated entities:
- Condition: "Biliary strictures"
- Condition: "benign tumors"
- Qualifier: "confirmed"